一50歲男性主訴下背痛，X光檢查顯示L2-L4壓迫性骨折（compression fracture）。 血液生化檢	結果如 下：albumin 3.0 g/dL（3.7～5.3)；total protein 4.2 g/dL（6.4～8.4）；calcium 10.4 mg/dL（8.4～10.6）； creatinine 2.5 mg/dL（0.7～1.5）；IgG 498 mg/dL（751～1560）；IgA 55 mg/dL（82～453）；IgM 27 mg/dL（46～304）；骨髓穿刺細胞學檢	顯示：normocellularity with fair maturation of erythroid and myeloid series，但有15% plasma cells，下列敘述何者錯誤？
A. 末稍血液抹片可能沒有rouleaux formation
B. 末稍血液抹片plasma cells很少見
C. 尿液dipstick test可偵測到蛋白尿
D. 小便檢	應可測出monoclonal light chain

正確答案：C. 尿液dipstick test可偵測到蛋白尿